下列何種 Cholinesterase inhibitor 為三級胺（Tertiary amine）可通過腦血屏障礙（Blood-brain barrier）？
A. Neostigmine
B. Edrophonium
C. Physostigmine
D. Pyridostigmine

正確答案：C. Physostigmine